Clinical trial exclusion criterion:
Regular cigarette smoker

Annotated entities:
- Observation: "Regular cigarette smoker"